What does VBP15 do to skeletal muscle?

VBP15 protects and promotes efficient repair of skeletal muscle cells.  Potent inhibition of NF-κB is mediated through protein interactions of the glucocorticoid receptor, however VBP15 shows significantly reduced hormonal receptor transcriptional activity. In DMD model mice it improves muscle strength, live-imaging and pathology through both preventive and post-onset intervention regimens.